王先生於 SARS 流行期間到大陸進行商務旅行，在香港停留一晚後返臺。回國後第 2 天晚上，即高燒至 40℃不退；經 X 光檢查，肺部有瀰漫性發炎現象。若抽血檢驗，預期可以測得對 SARS 冠狀病毒（SARS-coronavirus）的那一種抗體亞型？
A. IgA
B. IgE
C. IgG
D. IgM

正確答案：D. IgM